Clinical trial inclusion criterion:
Lack of land autoimmune (no history of thyroid disease or diabetes type 1)

Entity relations:
- Has_temporal("thyroid disease", "history")
- Has_negation("thyroid disease", "no")
- Subsumes("autoimmune", "thyroid disease")
- OR("thyroid disease", "diabetes type 1")